Clinical trial inclusion criterion:
Three or more failed trials of pharmacotherapy for the current GAD episode

Entity relations:
- Has_qualifier("trials of pharmacotherapy", "failed")
- Has_multiplier("trials of pharmacotherapy", "Three or more")
- AND("trials of pharmacotherapy", "GAD episode")
- Has_temporal("GAD episode", "current")